下列那兩條靜脈的連接，組成門脈系統與體循環系統的吻合（portal-systemic anastomosis）？
A. 腹壁上靜脈與旋髂淺靜脈（superior epigastric and superficial circumflex iliac vein）
B. 副臍靜脈與腹壁淺靜脈（paraumbilical veins and superficial epigastric vein）
C. 脾靜脈與下腸繫膜靜脈（splenic vein and inferior mesenteric vein）
D. 右與左胃網膜靜脈（right and left gastroepiploic vein）

正確答案：B. 副臍靜脈與腹壁淺靜脈（paraumbilical veins and superficial epigastric vein）